Ages 18-80

The above is a clinical trial inclusion criterion. Annotated with entity spans:
[Person: Ages] [Value: 18-80]